Clinical trial inclusion criterion:
Of either gender, aged ≥19 and ≤70 years

Annotated entities:
- Person: "aged"
- Value: "≥19 and ≤70 years"